下列有關腦膜瘤（meningioma）之敘述，何者正確？
A. 使用抗女性荷爾蒙（antiestrogen）治療是有效的
B. 應先使用放射線治療（radiotherapy）
C. 是後顱窩（posterior fossa）最常見之腫瘤
D. 加碼刀（gamma knife）的治療限於小於3公分者

正確答案：D. 加碼刀（gamma knife）的治療限於小於3公分者